9 歲男童陳述白天有頻尿、急尿，甚至會尿濕褲子的現象，而且每夜尿床，此病例尿床的治療法最佳選擇是：
A. 睡前使用 desmopressin（DDAVP）
B. 白天與睡前使用 alpha adrenergic antagonist，如 doxazosin
C. 白天與睡前使用 anticholinergic，如 oxybutynin
D. 只在睡前使用 imipramine

正確答案：C. 白天與睡前使用 anticholinergic，如 oxybutynin